Clinical trial exclusion criterion:
Left ventricular ejection fraction (LVEF) below 50% within approximately 28 days prior to randomization.

Annotated entities:
- Measurement: "Left ventricular ejection fraction (LVEF)"
- Value: "below 50%"
- Temporal: "within approximately 28 days prior to randomization"
- Reference_point: "randomization"